下列何種癌症轉移至骨骼的機會最低？
A. 乳癌
B. 肝癌
C. 肺癌
D. 攝護腺癌

正確答案：B. 肝癌